腦中風患者的肢體可能會出現骨骼肌張力過高（hypertonia）的現象，下列有關肌張力（muscle tone）的描述何者錯誤？
A. 肌張力過高的現象主要與上行體感覺神經路徑（somatosensory pathway）的功能受損有關
B. 肌張力過高與 alpha 運動神經元活性增高有關
C. 依臨床分類，alpha 運動神經元屬於下運動神經元（lower motor neurons）
D. 小腦損傷可能導致肌張力過低（hypotonia）

正確答案：A. 肌張力過高的現象主要與上行體感覺神經路徑（somatosensory pathway）的功能受損有關